Clinical trial inclusion criterion:
failure of current antiretroviral regimen due to:

Entity relations:
- Has_temporal("antiretroviral regimen", "current")
- AND("failure of current antiretroviral regimen", "antiretroviral regimen")